¿Cuál de los antibióticos reseñados es un inhibidor de penicilasa?:
1. Ácido pipemídico.
2. Linezólido.
3. Tazobactam.
4. Trimetoprim.

Respuesta correcta: 3. Tazobactam.